Clinical trial inclusion criteria:
18-65 years old
Male or female
Diagnosed with GAD according to DSM-IV
HAMA score=17
Provide with written informed consent
Agree to be washed-out for two weeks if receiving SSRI, SNRI or NASA.

Annotated entities:
- Person: "years old"
- Value: "18-65"
- Person: "Male"
- Person: "female"
- Condition: "GAD"
- Measurement: "DSM-IV"
- Measurement: "HAMA score"
- Value: "=17"
- Post-eligibility: "Provide with written informed consent"
- Procedure: "SSRI"
- Procedure: "SNRI"
- Procedure: "NASA"
- Temporal: "for two weeks"
- Procedure: "washed-out"